救護人員在參與災難的救援工作後，壓力調適過程中，下列敘述何者錯誤？
A. 對風險判斷力下降，工作效率與配合度變差是警訊
B. 醫護人員對於處理罹難者遺骸較有經驗，故少有困擾
C. 成熟的人格特質有助調適
D. 曾接受災難醫學訓練者較具抗壓性

正確答案：B. 醫護人員對於處理罹難者遺骸較有經驗，故少有困擾